有關孕婦併有主動脈狹窄（aortic stenosis）的敘述，下列何者錯誤？
A. 懷孕時因為心血管的前負荷（preload）下降，孕婦症狀會變嚴重
B. 對於沒有症狀的孕婦，不需要做任何治療
C. 對於有症狀的孕婦，建議以氣球擴張術（balloon valvotomy）治療
D. 若是嘗試陰道生產時，待產時建議注意輸液量不能過少，生產時建議使用產鉗或真空吸幫助生產

正確答案：C. 對於有症狀的孕婦，建議以氣球擴張術（balloon valvotomy）治療